王先生，60 歲，因急性心肌梗塞住進心臟加護病房（CCU），經檢查並無心律不整、鬱血性心衰竭或其他併發症。第一次運動耐力測試（exercise tolerance test）通常於心肌梗塞後何時進行？
A. 急性期（acute phase）
B. 恢復期（convalescent phase）
C. 訓練期（training phase）
D. 維持期（maintenance phase）

正確答案：C. 訓練期（training phase）